急性前壁心肌梗塞併有下列何種病況時，不宜使用靜脈注射血栓溶解劑？
A. 過去一年有腦出血
B. 血壓 140/90 mmHg
C. 女性 48 歲正值月經來潮
D. 男性 68 歲

正確答案：A. 過去一年有腦出血